Clinical trial exclusion criterion:
Severe sepsis with multiorgan failure

Annotated entities:
- Condition: "Severe sepsis"
- Condition: "multiorgan failure"